¿Con qué aspecto se relaciona la dificultad de las personas mayores para resolver nuevos problemas?:
1. Creatividad.
2. Motivación.
3. Fluidez verbal.
4. Memoria.
5. Tiempo de respuesta.

Respuesta correcta: 5. Tiempo de respuesta.